History of keratitis, ulcerative keratitis or severe dry eye.

The above is a clinical trial exclusion criterion. Annotated with entity spans:
History of [Condition: keratitis], [Condition: ulcerative keratitis] or [Qualifier: severe] [Condition: dry eye].